Clinical trial exclusion criterion:
Pregnancy and lactation period.

Annotated entities:
- Condition: "Pregnancy"
- Condition: "lactation period"